14. Concomitant administration of any prescription or over the counter medications known to alter P450 enzyme or P-gp activity

The above is a clinical trial exclusion criterion. Annotated with entity spans:
[Parsing_Error: 14.] [Temporal: Concomitant] administration of any prescription or over the counter [Drug: medications known to alter P450 enzyme] or P-gp activity